How many families did the 100,000 Genomes Pilot enrol?

The 100,000 Genomes Project is a pilot study involving 4660 participants from 2183 families, among whom 161 disorders covering a broad spectrum of rare diseases were present.